Unable to undergo MRI

The above is a clinical trial exclusion criterion. Annotated with entity spans:
[Condition: Unable to undergo] [Procedure: MRI]